Foreshortened life-expectancy or severe comorbidities precluding study follow-up period

The above is a clinical trial exclusion criterion. Annotated with entity spans:
[Value: Foreshortened] [Observation: life-expectancy] or [Condition: severe comorbidities] precluding study follow-up period